下列何者纖維母細胞（fibroblasts）無法合成？
A. 膠原纖維（collagen fibers）
B. 彈性纖維（elastic fibers）
C. 網狀纖維（reticular fibers）
D. 肌原纖維（myofibrils）

正確答案：D. 肌原纖維（myofibrils）